Clinical trial inclusion criterion:
Residing in the Manya Krobo or Yilo Krobo district

Entity relations:
- AND("Residing", "Manya Krobo district")
- OR("Manya Krobo district", "Yilo Krobo district")